Clinical trial inclusion criterion:
Have features of severe pneumonia on admission (temperature >37.5 celsius or a history of fever at home or observed at the referring clinic, age-adjusted tachypnoea [respiratory rate>50 if <12-months; respiratory rate>40 if >12-months] with chest wall recession and/or oxygen saturation <92% in air), and consolidation on chest X-ray as diagnosed by treating clinician

Entity relations:
- Has_qualifier("pneumonia", "severe")
- Has_value("temperature", ">37.5 celsius")
- Has_value("respiratory rate", ">50")
- Has_value("respiratory rate", ">40")
- Has_value("age", "<12-months")
- Has_value("age", ">12-months")
- AND("age", "respiratory rate")
- AND("age", "respiratory rate")
- AND("tachypnoea", "age")
- AND("tachypnoea", "age")
- Has_value("oxygen saturation", "<92% in air")
- AND("tachypnoea", "chest wall recession")
- Subsumes("pneumonia", "temperature")
- AND("chest X-ray", "consolidation")
- Subsumes("pneumonia", "tachypnoea")
- OR("age", "age")
- OR("chest wall recession", "oxygen saturation")